Clinical trial inclusion criterion:
Women at any age with early stage breast cancer (stage I-II) and American Society of Anesthesiologists (ASA) score of I-II.

Annotated entities:
- Person: "Women"
- Person: "any age"
- Value: "early"
- Measurement: "stage"
- Condition: "breast cancer"
- Measurement: "stage"
- Value: "I-II"
- Measurement: "American Society of Anesthesiologists (ASA) score"
- Value: "I-II"